Clinical trial inclusion criterion:
written consent

Annotated entities:
- Informed_consent: "written consent"